Clinical trial exclusion criterion:
Medications associated with female sexual dysfunction; Antidepressants opiates, beta blockers, Antiepileptics ( gabapentin, topiramate,phenytoin) benzodiazepines

Annotated entities:
- Condition: "female sexual dysfunction"
- Drug: "Medications"
- Qualifier: "associated with female sexual dysfunction"
- Drug: "Antidepressants"
- Drug: "opiates"
- Drug: "beta blockers"
- Drug: "Antiepileptics"
- Drug: "gabapentin"
- Drug: "topiramate"
- Drug: "phenytoin"
- Drug: "benzodiazepines"